Are human enhancers or promoters evolving faster?

We report that rapid evolution of enhancers is a universal feature of mammalian genomes.